Clinical trial exclusion criterion:
5. Severe chronic obstructive pulmonary disease

Entity relations:
- Has_qualifier("chronic obstructive pulmonary disease", "Severe")